Clinical trial exclusion criterion:
For CTCL: (TSEBT) within 12 weeks, or initiation of topical steroid, nitrogen mustard, or topical retinoid within 2 weeks. (Stable topical ≥ 4 weeks prior to Day 1 allowed).

Entity relations:
- Has_temporal("TSEBT", "within 12 weeks")
- Has_context("topical steroid", "initiation")
- Has_temporal("topical steroid", "within 2 weeks")
- Has_index("≥ 4 weeks prior to Day 1", "Day 1")
- OR("topical steroid", "nitrogen mustard", "topical retinoid")